Inability to give informed consent by patient or healthcare proxy

The above is a clinical trial exclusion criterion. Annotated with entity spans:
[Informed_consent: Inability to give informed consent by patient or healthcare proxy]